Exercise-limiting claudication established by history and direct observation during a screening walking test administered by the evaluating vascular surgeon,

The above is a clinical trial inclusion criterion. Annotated with entity spans:
[Condition: Exercise-limiting claudication] established by [Temporal: history] and [Procedure: direct observation] during a [Procedure: screening walking test] administered by the evaluating vascular surgeon,